Clinical trial exclusion criterion:
Inability to complete an MRI (contraindications for MRI include but are not restricted to weight =140 kg, pacemaker, cochlear implants, presence of foreign substances in the eye, intracranial vascular clips, surgery within 6 weeks of entry into the study, coronary stent implanted within 8 weeks prior to the time of the intended MRI, etc…)

Entity relations:
- Has_mood("MRI", "Inability to complete")
- AND("contraindications", "MRI")
- Has_value("weight", "=140 kg")
- Has_index("within 6 weeks of entry into the study", "entry into the study")
- Has_mood("MRI", "intended")
- multi("the time of the intended MRI", "MRI")
- Has_index("within 8 weeks prior to the time of the intended MRI", "the time of the intended MRI")
- Has_temporal("implanted", "within 8 weeks prior to the time of the intended MRI")
- AND("implanted", "coronary stent")
- Has_temporal("surgery", "within 6 weeks of entry into the study")
- Subsumes("contraindications", "weight")
- Subsumes("MRI", "weight")
- OR("weight", "pacemaker", "surgery", "implanted", "intracranial vascular clips", "foreign substances in the eye", "cochlear implants")